Clinical trial exclusion criterion:
The use of insulin within the 3 months prior to screening

Entity relations:
- Has_temporal("insulin", "within the 3 months prior to screening")
- Has_index("within the 3 months prior to screening", "screening")